major fetal abnormalities

The above is a clinical trial exclusion criterion. Annotated with entity spans:
[Qualifier: major] [Condition: fetal abnormalities]